Clinical trial exclusion criterion:
3. Have been taking corticosteroids for longer than 48 hours.

Annotated entities:
- Drug: "corticosteroids"
- Temporal: "longer than 48 hours"